patients with =20° passive extension deficit (PED) in metacarpophalangeal (MP) or proximal interphalangeal (PIP) joint, or TPED of =30° in MP and PIP joints of finger/fingers II-V

The above is a clinical trial inclusion criterion. Annotated with entity spans:
patients with [Qualifier: =20°] [Condition: passive extension deficit (PED)] in metacarpophalangeal (MP) or [Qualifier: proximal interphalangeal (PIP) joint], or [Condition: TPED] of [Qualifier: =30°] in [Qualifier: MP] and [Qualifier: PIP joints] of [Qualifier: finger/fingers II-V]